Clinical trial inclusion criterion:
Patient with known CYP2C19 genotype prior to randomization

Entity relations:
- Has_index("prior to randomization", "randomization")
- Has_temporal("CYP2C19 genotype", "prior to randomization")